Clinical trial inclusion criterion:
Surgical patients 60 years of age or older

Entity relations:
- Has_value("age", "60 years or older")